For what is Protein A from Staphylococcus aureus used in biochemistry?

Protein A from the bacterium Staphylococcus aureus (SpA) is used as an affinity ligand for purification of immunoglobulin G (IgG).